Clinical trial exclusion criterion:
Patients with moderate to severe hepatic encephalopathy.

Entity relations:
- Has_qualifier("hepatic encephalopathy", "moderate")
- OR("moderate", "severe")